對於胰臟（pancreas）的內分泌部（endocrine portion）之敘述，下列何項正確？
A. 是漿液腺（serous gland）組成
B. 是蘭氏小島（islets of Langerhans）
C. 是泡心細胞（centroacinar cells）組成
D. 組成細胞內部有許多嗜酸性的酶原顆粒（zymogen granules）

正確答案：B. 是蘭氏小島（islets of Langerhans）